4. hypertension (systolic blood pressure ≥ 140 or diastolic blood pressure ≥90 mmHg or treatment with antihypertensive drugs).

The above is a clinical trial inclusion criterion. Annotated with entity spans:
4. [Condition: hypertension] ([Measurement: systolic blood pressure] [Value: ≥ 140] or [Measurement: diastolic blood pressure] [Value: ≥90 mmHg] or [Procedure: treatment] with [Drug: antihypertensive drugs]).